Clinical trial inclusion criterion:
Known history of severe hepatic impairment

Annotated entities:
- Condition: "hepatic impairment"
- Qualifier: "severe"